78歲的連先生在接受大腸鏡檢查時，被診斷罹患大腸癌，初步評估應該屬於早期。當主治醫師吳醫師想將病理檢查結果告知連老先生時，連老先生的家屬要求吳醫師隱瞞病情，並幫連老先生決定了拒絕進一步的檢查 及治療。吳醫師應如何處理較為合適？
A. 先詢問連老先生是否想知道自己的病情，如果連老先生想了解自己的病情，即使其家屬反對醫師告知病情，仍然應該向連老先生告知相關病情
B. 先詢問連老先生是否想知道自己的病情，如果連老先生並不想了解自己的病情，就不要再施予任何檢查或者治療
C. 連老先生的家屬已經明白表示不要將相關的病情告知連老先生，因此不必再詢問連老先生的意願，而應該按照其家屬的請求隱瞞病情，同時不要再施予任何檢查或治療
D. 連老先生的家屬已經明白表示不要將相關的病情告知連老先生，因此應該按照其家屬的請求而隱瞞病情。然而其家屬所做的醫療決定不利於連老先生的最佳利益，因此醫師應該依照醫療常規，幫連老先生繼續相

正確答案：A. 先詢問連老先生是否想知道自己的病情，如果連老先生想了解自己的病情，即使其家屬反對醫師告知病情，仍然應該向連老先生告知相關病情